Hemosuccus pancreaticus 的準確意義為：
A. 胰臟出血
B. 因胰臟炎而流血至腹腔
C. 因胰臟炎引起的假性動脈瘤出血流進胰管
D. 因胰臟炎引起胃潰瘍出血

正確答案：C. 因胰臟炎引起的假性動脈瘤出血流進胰管